Clinical trial exclusion criterion:
History of deep venous thrombosis

Entity relations:
- Has_temporal("deep venous thrombosis", "History")